Clinical trial exclusion criterion:
With a elevated post-void residual (defined as PVR > 100cc)

Entity relations:
- Has_value("PVR", "> 100cc")
- Subsumes("post-void residual", "PVR")
- Has_value("post-void residual", "elevated")